Is the transcriptional regulator BACH1 an activator or a repressor?

BACH1 is, in most contexts, a transcriptional repressor